Clinical trial exclusion criterion:
Potentially unreliable subjects, and those judged by the investigator to be unsuitable for the study.

Entity relations:
- OR("unreliable subjects", "unsuitable for the study")